Clinical trial inclusion criteria:
Moderate to severe rheumatoid arthritis
Taking methotrexate without adequate control of symptoms
Have at least one cardiovascular risk factor (eg, current smoker, high blood pressure, high cholesterol levels, diabetes mellitus, history of heart attack, family history of coronary heart disease, extra-articular RA disease)

Annotated entities:
- Qualifier: "Moderate to severe"
- Condition: "rheumatoid arthritis"
- Drug: "methotrexate"
- Negation: "without"
- Observation: "adequate control of symptoms"
- Multiplier: "at least one"
- Condition: "cardiovascular risk factor"
- Temporal: "current"
- Observation: "smoker"
- Condition: "high blood pressure"
- Condition: "high cholesterol levels"
- Condition: "diabetes mellitus"
- Temporal: "history"
- Condition: "heart attack"
- Observation: "family history"
- Condition: "coronary heart disease"
- Qualifier: "extra-articular"
- Condition: "RA disease"